鼻樑（bridge of nose）上皮膚之感覺由下列何神經傳導？
A. 眼神經（ophthalmic nerve）
B. 上頜神經（maxillary nerve）
C. 面神經（facial nerve）
D. 視神經（optic nerve）

正確答案：A. 眼神經（ophthalmic nerve）